En el tipo más frecuente de atresia de esófago:
1. La ecografía prenatal realizada en el tercer trimestre permite el diagnóstico en un 6080% de casos.
2. Se asocia en un 50% de casos a microgastria y defectos del tubo neural.
3. La distancia entre los bolsones atrésicos proximal y distal es mayor que en los otros tipos de atresia.
4. Debe realizarse una gastrostomía en las primeras 48 horas de vida para permitir la alimentación enteral.
5. La presencia de aire en el estómago e intestino delgado en la radiografía de abdomen confirma la existencia de una fístula distal.

Respuesta correcta: 5. La presencia de aire en el estómago e intestino delgado en la radiografía de abdomen confirma la existencia de una fístula distal.